Clinical trial exclusion criterion:
21. Transaminases (alanine transaminase, aspartate transaminase) levels >3 × upper limit of normal (ULN) and/or bilirubin level >2 × ULN.

Annotated entities:
- Parsing_Error: "21."
- Measurement: "alanine transaminase"
- Measurement: "aspartate transaminase"
- Value: ">3 × upper limit of normal (ULN)"
- Measurement: "Transaminases levels"
- Measurement: "bilirubin level"
- Value: ">2 × ULN"